就急性冠狀動脈症候群之醫療處置而言，下列何者錯誤？
A. 低血壓與 24 小時內使用過 sildenafil 為使用 nitrate 類藥物之絕對禁忌
B. 若病人無過高之出血風險，建議合併使用 aspirin 與 thienopyridine 類藥物
C. Morphine 可用以緩解病人之呼吸低下（respiratory depression）症狀
D. 當懷疑病人為冠狀動脈痙攣性心絞痛，可使用鈣離子阻斷劑

正確答案：C. Morphine 可用以緩解病人之呼吸低下（respiratory depression）症狀